Clinical trial inclusion criterion:
Age >18 years old

Annotated entities:
- Person: "Age"
- Value: ">18 years old"